Clinical trial exclusion criterion:
Patients with a known allergy to ketamine or etomidate.

Annotated entities:
- Condition: "allergy"
- Drug: "ketamine"
- Drug: "etomidate"